Clinical trial exclusion criterion:
Has known intolerance or documented adverse reaction to acetaminophen or naproxen or celecoxib

Annotated entities:
- Drug: "acetaminophen"
- Drug: "naproxen"
- Drug: "celecoxib"
- Condition: "adverse reaction"
- Condition: "intolerance"